Another obvious severe disease explaining insomnia

The above is a clinical trial exclusion criterion. Annotated with entity spans:
Another obvious [Condition: severe disease] explaining [Condition: insomnia]